A common problem in proteomics is the contamination of samples with exogenous proteins (often from other species). These proteins can be found in specific databases. List some contaminants.

Some common contaminants in proteomics are proteases (used for the digestion of the proteins), keratins (usually from the skin),  proteins originated from the serum of the culture media and antibodies if used in the experiment.